Clinical trial inclusion criterion:
Age ≥ 18 years (Age ≥ 12 years for patients with bone sarcomas).

Entity relations:
- Has_value("Age", "≥ 18 years")
- Has_value("Age", "≥ 12 years")
- AND("bone sarcomas", "Age")
- OR("Age", "bone sarcomas")